La penicilina inhibe la síntesis de:
1. La membrana plasmática.
2. El lipopolisacárido.
3. El RNA ribosomal.
4. El peptidoglicano o mureína.

Respuesta correcta: 4. El peptidoglicano o mureína.